Treatment naïve, i.e., no previous anti-VEGF treatment in the study eye or no anti-VEGF treatment in the 45 days prior to study enrollment.

The above is a clinical trial inclusion criterion. Annotated with entity spans:
[Observation: Treatment naïve], i.e., [Negation: no] [Temporal: previous] [Procedure: anti-VEGF treatment] [Qualifier: in the study eye] or [Negation: no] [Procedure: anti-VEGF treatment] [Temporal: in the 45 days prior to study enrollment].